Nonfluency or inability to communicate in English spoken language

The above is a clinical trial exclusion criterion. Annotated with entity spans:
[Non-query-able: Nonfluency or inability to communicate in English spoken language]